What are the 3 main bacteria found in human milk?

Human milk is rich in diverse bacteria, particularly Staphylococcus, Streptococcus and Pseudomonas genera.